下列何種X光片攝影，上頜竇可能部分會被顳骨岩脊（petrous ridge）遮住而判讀不易？
A. Waters view
B. Caldwell view
C. skull lateral view
D. submental view

正確答案：B. Caldwell view